缺少維生素B1B 時會導致下列何種酶的活性降低？
A. Succinate dehydrogenase
B. Glucose 6-phosphate dehydrogenase
C. α-Ketoglutarate dehydrogenase
D. Transaldolase

正確答案：C. α-Ketoglutarate dehydrogenase